一名55歲男性有糖尿病病史，血壓160/100 mmHg，經尿液常規檢查：protein(+)，血清中的
 creatinine數值：1.0 mg/dL，其餘生化檢查並無異常的發現，則起始藥物的選擇以下列何者較為適當？
A. 利尿劑（diuretics）
B. angiotensin-converting enzyme inhibitors / angiotensin receptor blockers
C. beta-blockers
D. methyldopa

正確答案：B. angiotensin-converting enzyme inhibitors / angiotensin receptor blockers